Regular menstruation cycle

The above is a clinical trial inclusion criterion. Annotated with entity spans:
[Condition: Regular menstruation cycle]